Clinical trial inclusion criterion:
Men and women 18-89 years old

Entity relations:
- Has_value("old", "18-89 years")
- OR("Men", "women")